Clinical trial exclusion criterion:
Diabetes or immediate family history of diabetes

Annotated entities:
- Condition: "Diabetes"
- Observation: "immediate family history"
- Condition: "diabetes"